Clinical trial exclusion criterion:
8. Other malignancy within 2 years prior to Day 1 of the study, except for those treated with surgical intervention only.

Entity relations:
- Has_index("within 2 years prior to Day 1 of the study", "Day 1 of the study")
- Has_temporal("malignancy", "within 2 years prior to Day 1 of the study")
- Has_negation("surgical intervention", "except for")
- AND("those", "surgical intervention")
- AND("malignancy", "those")